weight over 40 kg

The above is a clinical trial inclusion criterion. Annotated with entity spans:
[Measurement: weight] [Value: over 40 kg]